Clinical trial exclusion criterion:
In the Investigator's opinion, is at high risk for infection (e.g., indwelling catheter, dysphagia with aspiration, decubitus ulcer, history of prior aspiration pneumonia or recurrent urinary tract infection)

Annotated entities:
- Observation: "risk for infection"
- Qualifier: "high"
- Device: "indwelling catheter"
- Condition: "dysphagia"
- Condition: "aspiration"
- Condition: "decubitus ulcer"
- Condition: "aspiration pneumonia"
- Condition: "urinary tract infection"
- Qualifier: "recurrent"